Patients with diagnosis of multiple myeloma according to criteria of the International Myeloma Working Group

The above is a clinical trial inclusion criterion. Annotated with entity spans:
Patients with diagnosis of [Condition: multiple myeloma] according to [Measurement: criteria of the International Myeloma Working Group]